Clinical trial inclusion criterion:
History of coronary artery disease (MI/heart attack, stroke, heart failure, or peripheral artery disease)

Entity relations:
- Has_temporal("coronary artery disease", "History")
- Subsumes("coronary artery disease", "MI")
- OR("MI", "peripheral artery disease", "stroke", "heart attack", "heart failure")